Patient who pregnant

The above is a clinical trial exclusion criterion. Annotated with entity spans:
Patient who [Condition: pregnant]